下列何種藥物用於治療嗜鉻細胞瘤（pheochromocytoma），但會產生錐體外路徑症狀之副作用？
A. labetalol
B. metyrosine
C. phenoxybenzamine
D. tamsulosin

正確答案：B. metyrosine